What are 2 organisms that can cause Human toxocariasis?

Human toxocariasis , a worldwide parasitic disease , is caused by the larval stage of intestinal nematodes of dogs and cats , namely Toxocara canis and Toxocara cati